Clinical trial inclusion criterion:
Patient is eligible for PCI

Entity relations:
- Has_mood("PCI", "eligible")